Clinical trial exclusion criterion:
Previous hyperresponse with OHSS development

Annotated entities:
- Condition: "hyperresponse"
- Observation: "OHSS development"
- Temporal: "Previous"